Clinical trial inclusion criterion:
Failure of prior therapy (during or after treatment) in patients who have received at least two prior chemotherapy regimens;

Entity relations:
- Has_multiplier("chemotherapy", "at least two")
- Has_qualifier("chemotherapy", "Failure")